一位慢性 C 型肝炎患者接受腹部超音波檢查發現有肝硬化，抽血檢驗結果如下：albumin = 2.7 g/dL （正常值＞3.5），bilirubin（total）= 2.0 mg/dL（正常值＜1.2），prothrombin time（PT）INR = 1.5， WBC = 3,000/mm3（正常值＞4,000），platelet = 8 K/mm3（正常值＞15K）。最近常便秘，但又喜歡肉食，有一天，他被發現神智不清而被送至急診室，下列各項敘述，何者錯誤？
A. 身體診察很可能會發現有撲拍性震顫（flapping tremor）
B. 抽血檢驗 ammonia（NH3）值 = 32 μg/dL（正常值＜37）
C. 應儘速灌腸通便（enema）
D. 目前應限制動物蛋白質攝取

正確答案：B. 抽血檢驗 ammonia（NH3）值 = 32 μg/dL（正常值＜37）